一位 3 個月大男嬰，媽媽主訴男嬰餵食不良（poor feeding）及蒼白（pallor）盜汗（cold sweating），身體診查發現心跳 260 次/分，血壓 76/40 mmHg，最可能診斷為何？
A. 發高燒（high fever）
B. 敗血症（sepsis）
C. 上心室頻脈（supraventricular tachycardia）
D. 竇性頻脈（sinus tachycardia）

正確答案：C. 上心室頻脈（supraventricular tachycardia）